Clinical trial inclusion criteria:
Age 60 years or older.
Current diagnosis of major depressive disorder (DSM-IV-TR), single episode, recurrent or chronic, without psychotic features, as detected by MINI and clinical exam.
Minimum MADRS score = 15.
Mini-Mental State Exam = 24.
Fluent in English.

Annotated entities:
- Person: "Age"
- Value: "60 years or older"
- Condition: "major depressive disorder"
- Procedure: "DSM-IV-TR"
- Multiplier: "single episode"
- Multiplier: "recurrent"
- Multiplier: "chronic"
- Negation: "without"
- Condition: "psychotic features"
- Procedure: "MINI"
- Procedure: "clinical exam"
- Measurement: "MADRS score"
- Value: "Minimum = 15"
- Measurement: "Mini-Mental State Exam"
- Value: "= 24"
- Non-query-able: "Fluent in English."